¿Cuál de los siguientes NO es un factor de riesgo para el cáncer de endometrio?:
1. Obesidad.
2. Multiparidad.
3. Menopausia tardía.
4. Menarquia precoz.

Respuesta correcta: 2. Multiparidad.